Cuál de los siguientes diagnósticos de la NANDA, NO es pertinente en el paciente recién operado:
1. Dolor agudo.
2. Riesgo de déficit de volumen de líquido.
3. Patrón respiratorio ineficaz.
4. Alteración de la interacción social.
5. Limpieza ineficaz de la vía respiratoria.

Respuesta correcta: 4. Alteración de la interacción social.